Clinical trial inclusion criteria:
Male and female subjects aged 9 to 17 months on the day of inclusion
Informed consent form has been signed and dated by the parent(s) or other legally acceptable representative(s) (if applicable)
Subject and parent/legally acceptable representative (if applicable) able to attend all scheduled visits and to comply with all trial procedures.

Annotated entities:
- Person: "Male"
- Person: "female"
- Person: "aged"
- Value: "9 to 17 months"
- Temporal: "on the day of inclusion"
- Reference_point: "the day of inclusion"
- Grammar_Error: "and"
- Non-query-able: "Informed consent form has been signed and dated by the parent(s) or other legally acceptable representative(s) (if applicable)"
- Non-query-able: "Subject and parent/legally acceptable representative (if applicable) able to attend all scheduled visits and to comply with all trial procedures."
- Post-eligibility: "Subject and parent/legally acceptable representative (if applicable) able to attend all scheduled visits and to comply with all trial procedures."